Clinical trial exclusion criterion:
1. Currently pregnant or last pregnancy outcome within 3 months prior to enrolment

Entity relations:
- multi("within 3 months prior to enrolment", "enrolment")
- Has_qualifier("pregnancy outcome", "last")
- multi("last", "last")
- Has_temporal("pregnancy outcome", "within 3 months prior to enrolment")
- Has_temporal("pregnant", "Currently")
- OR("pregnant", "pregnancy outcome")